5. Osteomyelitis or prosthetic joint infection except new onset nonhardware-associated vertebral osteomyelitis.

The above is a clinical trial exclusion criterion. Annotated with entity spans:
5. [Condition: Osteomyelitis] or [Condition: prosthetic joint infection] [Negation: except] [Temporal: new onset] [Qualifier: nonhardware-associated] [Condition: vertebral osteomyelitis].